9. Patients taking melatonin receptor agonists (such as Rozerem® [ramelteon]).

The above is a clinical trial exclusion criterion. Annotated with entity spans:
9. Patients taking [Drug: melatonin receptor agonists] (such as [Drug: Rozerem]® [[Drug: ramelteon]]).